Clinical trial exclusion criterion:
Patients surgically treated for the same defect within one year;

Entity relations:
- AND("surgically treated", "the same defect")
- Has_temporal("surgically treated", "within one year")